下列有關世界衛生組織對緩和醫療的定義，何者錯誤？
A. 針對無法治癒的末期病人所提供之積極性照護
B. 以病人為中心的照護，因此服務的對象僅限於病人
C. 服務的內容包括身體心理社會靈性的整體性照顧
D. 以提昇病人生活品質達到善終為目標

正確答案：B. 以病人為中心的照護，因此服務的對象僅限於病人